Severe chronic insomnia, with reported usual sleep duration <4 hours

The above is a clinical trial exclusion criterion. Annotated with entity spans:
Severe [Condition: chronic insomnia], with reported usual [Observation: sleep duration] [Value: <4 hours]